9. Any Grade 2, 3 or 4 baseline haematology, chemistry or urinalysis laboratory abnormality according to the DAIDS Table for Grading Adverse Experiences

The above is a clinical trial exclusion criterion. Annotated with entity spans:
9. Any [Value: Grade 2, 3 or 4] [Temporal: baseline] [Condition: haematology], [Condition: chemistry] or [Condition: urinalysis] [Condition: laboratory abnormality] according to the [Measurement: DAIDS Table for Grading Adverse Experiences]